Clinical trial exclusion criterion:
Women who are pregnant or nursing/breastfeeding.

Annotated entities:
- Person: "Women"
- Condition: "pregnant"
- Condition: "nursing"
- Observation: "breastfeeding"